一位 80 歲老先生騎車車禍受傷前額著地，送至急診室時上肢肌力約 2 分，下肢約 3-4 分，病人原本就有頸椎退化疾病病史。理學檢查雙側均有 Hoffmann's sign 及雙側深部肌腱反射（DTR）增強情形 ，並仍保有肛門縮肛功能（anal tone preserved）。則這位老先生最可能是何種脊椎損傷？
A. 中央脊髓症候群（central cord syndrome）
B. 前側脊髓症候群（anterior cord syndrome）
C. Brown-Séquard syndrome
D. 頸脊髓完全斷裂

正確答案：A. 中央脊髓症候群（central cord syndrome）